Clinical trial exclusion criterion:
Patients with known brain metastases, unless these metastases have been treated and/or have been stable for at least six months prior to study start. Subjects with a history of brain metastases must have a head CT with contrast to document either response or progression.

Annotated entities:
- Procedure: "treated"
- Qualifier: "been stable for"
- Temporal: "at least six months prior to study start"
- Condition: "brain metastases"
- Temporal: "history of"
- Condition: "brain metastases"
- Procedure: "head CT with contrast"
- Negation: "unless"